14. Unprotected left main coronary artery disease (stenosis greater than 50%).

The above is a clinical trial exclusion criterion. Annotated with entity spans:
14. [Qualifier: Unprotected] [Condition: left main coronary artery disease] ([Measurement: stenosis] [Value: greater than 50%]).